Clinical trial inclusion criterion:
Physically healthy adults age 18-55 who meet DSM-5 criteria for insomnia and Criterion A (exposure to a traumatic event) for PTSD. The index trauma must have occurred within the past 5 years and at least 3 months before enrolling, and insomnia symptoms must have started or worsened after the exposure to the index trauma

Entity relations:
- Has_qualifier("adults", "healthy")
- Has_value("age", "18-55")
- Has_qualifier("insomnia", "DSM-5")
- Has_qualifier("PTSD", "Criterion A")
- Has_qualifier("trauma", "index")
- Has_temporal("trauma", "the past 5 years and at least 3 months")